Presence of an AIDS-defining opportunistic infection within 6 months prior to entry. Note: Refer to the A5324 Manual of Operations (MOPS) for the list of AIDS-defining opportunistic infections.

The above is a clinical trial exclusion criterion. Annotated with entity spans:
Presence of an [Condition: AIDS-defining opportunistic infection] [Temporal: within 6 months prior to entry]. Note: Refer to the A5324 Manual of Operations (MOPS) for the list of AIDS-defining opportunistic infections.